La estabilización estérica en sistemas dispersos es:
1. Más efectiva en dispersiones acuosas.
2. Más eficaz con fracciones de volumen de partículas pequeñas.
3. Eficaz en dispersiones acuosas y no acuosas.
4. Coagula al adicionar electrolitos.
5. Susceptible a la coagulación reversible.

Respuesta correcta: 3. Eficaz en dispersiones acuosas y no acuosas.